Clinical trial exclusion criterion:
Active autoimmune disease that has required systemic treatment in past 2 years

Entity relations:
- Has_temporal("autoimmune disease", "Active")
- Has_temporal("systemic treatment", "in past 2 years")
- AND("autoimmune disease", "systemic treatment")